Clinical trial exclusion criterion:
Patients with any active infection including HBV, HCV and HIV.

Annotated entities:
- Condition: "active infection"
- Condition: "HBV"
- Condition: "HCV"
- Condition: "HIV"